Clinical trial inclusion criterion:
Hemoglobin = 11 g/dL for female subjects; = 12 g/dL for male subjects.

Annotated entities:
- Measurement: "Hemoglobin"
- Value: "= 11 g/dL"
- Person: "female"
- Value: "= 12 g/dL"
- Person: "male"